一個反應在有酵素催化及無酵素催化時，下列何項為正確？
A. 其平衡常數（equilibrium constant）會改變
B. 有酵素催化的反應其活化能（activation energy）會下降
C. 有酵素催化的反應其標準自由能變化（standard free energy change）會改變
D. 有酵素催化的反應其初始速度（initial velocity）會下降

正確答案：B. 有酵素催化的反應其活化能（activation energy）會下降